Clinical trial exclusion criterion:
No known history of seizure activity.

Entity relations:
- Has_negation("history", "No")
- Has_temporal("seizure activity", "history")